Patients who are positive for HCV antibody must be negative for HCV by polymerase chain reaction (PCR) to be eligible for study participation

The above is a clinical trial exclusion criterion. Annotated with entity spans:
Patients who are [Value: positive] for [Measurement: HCV antibody] must be [Value: negative] for [Measurement: HCV] by [Procedure: polymerase chain reaction (PCR)] to be eligible for study participation